Clinical trial inclusion criterion:
Must speak English or Spanish

Annotated entities:
- Non-query-able: "Must speak English or Spanish"